Able to consent in English or Spanish.

The above is a clinical trial inclusion criterion. Annotated with entity spans:
[Informed_consent: Able to consent in English or Spanish].